What is a SERM?

elective estrogen receptor modulator (SERM),